Unable to adhere to follow up schedule and treatment.

The above is a clinical trial exclusion criterion. Annotated with entity spans:
[Post-eligibility: Unable to adhere to follow up schedule and treatment.]